Clinical trial exclusion criterion:
Bradycardia (HR<55bpm)

Annotated entities:
- Condition: "Bradycardia"
- Measurement: "HR"
- Value: "<55bpm"